Clinical trial exclusion criterion:
secondary adhesive capsulitis (history of significant trauma, rotator cuff tear injury, stroke)

Entity relations:
- Has_qualifier("trauma", "significant")
- Has_temporal("trauma", "history")
- Has_qualifier("adhesive capsulitis", "secondary")
- Subsumes("adhesive capsulitis", "trauma")
- OR("trauma", "rotator cuff tear injury", "stroke")